Clinical trial exclusion criterion:
pregnant women

Annotated entities:
- Person: "women"
- Condition: "pregnant"